History of transurethral resection of the prostate (TURP), open prostate surgery, or radiofrequency or microwave therapies

The above is a clinical trial exclusion criterion. Annotated with entity spans:
History of [Procedure: transurethral resection of the prostate (TURP)], [Procedure: open prostate surgery], or [Procedure: radiofrequency] or [Procedure: microwave therapies]